Clinical trial exclusion criterion:
3. Cardiogenic shock on presentation or during current hospitalization.

Annotated entities:
- Condition: "Cardiogenic shock"
- Procedure: "hospitalization"
- Temporal: "current"